Clinical trial inclusion criterion:
SCI ( =1 month of injury)

Entity relations:
- Has_temporal("SCI", "=1 month of injury")